Clinical trial inclusion criterion:
Patients who are able to give informed consent.

Annotated entities:
- Informed_consent: "Patients who are able to give informed consent"